下列何種細胞具頂樹突（apical dendrite）可延伸至大腦皮質表面？
A. 星狀細胞（stellate cell）
B. 錐狀細胞（pyramidal cell）
C. 梭狀細胞（fusiform cell）
D. 水平細胞（horizontal cell）

正確答案：B. 錐狀細胞（pyramidal cell）